Clinical trial exclusion criterion:
Uncontrolled medical problems including pulmonary, cardiovascular or orthopedic disease,

Annotated entities:
- Condition: "orthopedic disease"
- Condition: "cardiovascular disease"
- Condition: "pulmonary disease"
- Condition: "medical problems"
- Qualifier: "Uncontrolled"